Patients hospitalized in medical, surgical or ICU wards

The above is a clinical trial inclusion criterion. Annotated with entity spans:
Patients [Procedure: hospitalized] in [Visit: medical], [Visit: surgical] or [Visit: ICU wards]